Clinical trial exclusion criterion:
adequately controlled with appropriate therapy or would compromise the patient's ability to tolerate this therapy; 2. Treatment with any systemic anticancer therapy ≤ 3 weeks prior to cycle 1 day 1 3. Uncontrolled active infection (Hepatitis B and C infection are NOT exclusion criteria) and/or known HIV infection; 4. Renal failure requiring haemodialysis or peritoneal dialysis; 5. Patients who are pregnant or breast-feeding; 6. Patients with significantly diseased or obstructed gastrointestinal tract, malabsorption, uncontrolled vomiting or diarrhea resulting in inability to swallow oral medications; 7. Presence of symptomatic CNS metastasis 8. Unresolved toxicity from previous anti-cancer therapy or incomplete recovery from surgery, in particular oxaliplatin-induced peripheral neuropathy > grade 1.

Entity relations:
- Has_index("≤ 3 weeks prior to cycle 1", "cycle 1")
- Has_temporal("systemic anticancer therapy", "≤ 3 weeks prior to cycle 1")
- Has_negation("Hepatitis B infection", "NOT")
- Has_negation("Hepatitis C infection", "NOT")
- Has_qualifier("infection", "Uncontrolled")
- Has_temporal("infection", "active")
- AND("infection", "Hepatitis B infection")
- AND("Renal failure", "haemodialysis")
- Has_qualifier("vomiting", "uncontrolled")
- Has_qualifier("CNS metastasis", "symptomatic")
- Has_temporal("anti-cancer therapy", "previous")
- Has_qualifier("peripheral neuropathy", "oxaliplatin-induced")
- AND("incomplete recovery", "surgery")
- Subsumes("incomplete recovery", "peripheral neuropathy")
- AND("Unresolved toxicity", "anti-cancer therapy")
- AND("infection", "Hepatitis C infection")
- OR("haemodialysis", "peritoneal dialysis")
- OR("pregnant", "breast-feeding")
- OR("diseased gastrointestinal tract", "obstructed gastrointestinal tract")
- OR("malabsorption", "diarrhea", "vomiting")
- OR("Unresolved toxicity", "incomplete recovery")